Name the phase 3 clinical trials for tofacitinib in colitis.

There are three phase 3, randomized, double-blind, placebo-controlled trials of tofacitinib therapy in adults with ulcerative colitis: OCTAVE Induction 1, OCTAVE Induction 2, OCTAVE Sustain.